What is the role of miR-193b in prostate cancer?

Overexpression of miR-193b led to the inhibition of the majority of the 41 genes in prostate cancer cell lines.